Clinical trial inclusion criterion:
1. Justification: Many illnesses may alter neural functioning as well as fMRI signals.

Annotated entities:
- Parsing_Error: "1."
- Not_a_criteria: "Justification: Many illnesses may alter neural functioning as well as fMRI signals."